關於說話（speech）和語言（language）使用的正常發展階段，下列何者正確？
A. 1歲時尚無法以姿勢來溝通表達
B. 2歲左右只能說5個以內不同的
C. 8歲開始能說組織完整的複雜句子
D. 3歲左右說的話通常家人可清楚了解

正確答案：D. 3歲左右說的話通常家人可清楚了解